一位 9 歲大的男童因最近一個月來發現夜尿症（nocturnal enuresis）至門診求診。男童自 3 歲之後晚上即不需要包尿布。下列何種處置最適當？
A. 給父母衛教，告訴他們這是暫時現象，將來自然會好
B. 開立抗利尿激素（DDAVP）給男童，改善其症狀
C. 需要進一步檢查以排除病態問題
D. 限制睡前之水分攝取是最好的治療方法

正確答案：C. 需要進一步檢查以排除病態問題